Clinical trial inclusion criterion:
Patient with known or suspected cirrhosis

Annotated entities:
- Mood: "suspected"
- Mood: "known"
- Condition: "cirrhosis"